55歲肝硬化患者，欲接受兒子捐肝進行移植手術，術前已知有大於3公升的腹水、腎功能不良及出血傾向，下列有關麻醉處置的敘述，何者錯誤？
A. 大量腹水可能增加吸入胃液風險，可以採取快速麻醉誘導（rapid sequence induction）
B. 肌肉鬆弛劑選取cisatracurium或atracurium，比vecuronium恰當
C. 吸入性麻醉劑（inhalational anesthetics）不適合用於這個病人
D. 可以輸注新鮮冷凍血漿（fresh frozen plasma）、血小板或冷凍沉澱品（cryoprecipitate）等來改善凝血功能；並做凝血功能監測

正確答案：C. 吸入性麻醉劑（inhalational anesthetics）不適合用於這個病人